Clinical trial exclusion criterion:
Subject with a known hypersensitivity to any component of the investigational medications, monoamine oxidase inhibitors, phosphodiesterase type 5 inhibitors or phenylethylamines

Entity relations:
- Has_qualifier("medications", "investigational")
- AND("medications", "hypersensitivity")
- OR("medications", "phenylethylamines", "monoamine oxidase inhibitors", "phosphodiesterase type 5 inhibitors")